Clinical trial exclusion criterion:
High-grade block in the absence of a functioning pacemaker.

Entity relations:
- Has_qualifier("pacemaker", "functioning")
- Has_negation("pacemaker", "in the absence of")
- AND("High-grade block", "pacemaker")